Clinical trial exclusion criterion:
Clinical history of lactose-intolerance or allergies to cow-milk

Annotated entities:
- Condition: "lactose-intolerance"
- Condition: "allergies to cow-milk"